2. For subjects in Cohort B: previous therapy for more than 48 hours with any parenteral antibiotic with activity against MRSA, except vancomycin and/or daptomycin, within 72 hours of positive blood culture results confirming persistence.

The above is a clinical trial exclusion criterion. Annotated with entity spans:
2. For subjects in [Observation: Cohort B]: [Temporal: previous] [Procedure: therapy] [Temporal: for more than 48 hours] with any [Drug: parenteral antibiotic with activity against MRSA], [Negation: except] [Drug: vancomycin] and/or [Drug: daptomycin], [Temporal: within 72 hours of positive blood culture results] confirming persistence.